Non-traumatic LBP: no substantial and direct trauma to the back within the previous month

The above is a clinical trial inclusion criterion. Annotated with entity spans:
[Qualifier: Non-traumatic] [Condition: LBP]: [Negation: no] [Qualifier: substantial] and [Qualifier: direct] [Condition: trauma] to the [Qualifier: back] [Temporal: within the previous month]